Clinical trial inclusion criterion:
Alanine transaminase (ALT) less than 3 x ULN

Entity relations:
- Has_value("Alanine transaminase (ALT)", "less than 3 x ULN")